Clinical trial inclusion criterion:
Singleton gestation .scheduled for ECV desiring CSE.

Annotated entities:
- Condition: "Singleton gestation"
- Procedure: "ECV"
- Procedure: "CSE"
- Mood: "desiring"
- Mood: "scheduled for"